Clinical trial inclusion criterion:
biopsy proven NASH

Annotated entities:
- Condition: "NASH"
- Procedure: "biopsy"